Clinical trial exclusion criterion:
25. Body Mass Index (BMI) > 30 kg/m²

Annotated entities:
- Parsing_Error: "25."
- Measurement: "Body Mass Index (BMI)"
- Value: "> 30 kg/m²"